Clinical trial inclusion criterion:
Have symptoms of vaginal odor and or/discharge

Annotated entities:
- Mood: "symptoms of"
- Condition: "vaginal odor"
- Condition: "vaginal discharge"